Clinical trial exclusion criterion:
History of severe head injury

Entity relations:
- Has_temporal("severe head injury", "History")